Clinical trial exclusion criterion:
DSM-IV diagnosis of Alcohol or Substance Dependence within the last six months (except nicotine) or DSM-5 diagnosis of Substance Use Disorder in the last six months (except nicotine)

Entity relations:
- Has_qualifier("Alcohol Dependence", "DSM-IV")
- Has_temporal("Alcohol Dependence", "within the last six months")
- Has_negation("nicotine", "except")
- AND("Alcohol Dependence", "nicotine")
- Has_qualifier("Substance Use Disorder", "DSM-5")
- Has_negation("nicotine", "except")
- Has_temporal("Substance Use Disorder", "in the last six months")
- Has_negation("Substance Use Disorder", "except")
- OR("Alcohol Dependence", "Substance Dependence")